Clinical trial exclusion criterion:
Patient treated with immunosuppressive within 1 month before study inclusion.

Entity relations:
- Has_index("within 1 month before study inclusion", "study inclusion")
- Has_temporal("immunosuppressive", "within 1 month before study inclusion")